Clinical trial inclusion criterion:
undergoing elective posterior spine multi-level instrumentation surgery

Entity relations:
- Has_qualifier("multi-level instrumentation surgery", "posterior spine")
- Has_qualifier("multi-level instrumentation surgery", "elective")
- Has_temporal("multi-level instrumentation surgery", "undergoing")